Clinical trial inclusion criterion:
LTBI diagnosis as per Canadian TB Standards using either the Tuberculin Skin Test (TST) or the Interferon Gamma Release Assay (IGRA)

Annotated entities:
- Condition: "LTBI"
- Measurement: "Tuberculin Skin Test"
- Measurement: "TST"
- Measurement: "Interferon Gamma Release Assay"
- Measurement: "IGRA"